Subject is pregnant or interested in becoming pregnant in the next two (2) years.

The above is a clinical trial exclusion criterion. Annotated with entity spans:
Subject is [Condition: pregnant] or [Mood: interested in becoming] [Condition: pregnant] [Temporal: in the next two (2) years].